Clinical trial exclusion criterion:
current ongoing psychiatric disorder

Entity relations:
- Has_temporal("psychiatric disorder", "ongoing")
- Has_temporal("psychiatric disorder", "current")